Clinical trial inclusion criterion:
Serum or plasma aminotransferases (AST, ALT) less than 3 times the upper limit of normal

Annotated entities:
- Measurement: "plasma aminotransferases"
- Measurement: "AST"
- Measurement: "ALT"
- Measurement: "Serum aminotransferases"
- Value: "less than 3 times the upper limit of normal"